Utilizan una transcriptasa inversa durante su replicación los:
1. Papovavirus.
2. Poliomavirus.
3. Hepadnavirus.
4. Parvovirus.
5. Herpesvirus.

Respuesta correcta: 3. Hepadnavirus.